Clinical trial inclusion criterion:
Patients must not have active local-regional disease prior to registration.

Annotated entities:
- Condition: "local-regional disease"
- Undefined_semantics: "local-regional disease"
- Temporal: "active"
- Negation: "not"